Clinical trial inclusion criterion:
Signed informed consent form (ICF)

Annotated entities:
- Informed_consent: "Signed informed consent form (ICF)"